Clinical trial inclusion criterion:
Patient is willing and able to provide informed written consent

Annotated entities:
- Post-eligibility: "Patient is willing and able to provide informed written consent"